發燒病人的處理，一般應該就發燒的病因（感染、免疫疾病等）對症下藥，不應該只是給予退燒處 理。但是在下列何種病人發燒時，退燒處置是有幫助？
A. 兒童有 febrile seizure 病史者
B. 懷孕 3 個月內的孕婦
C. 心臟、肺臟或中樞神經系統功能異常者
D. \ 以上皆是

正確答案：D. \ 以上皆是